Subjects who have received valproic acid for treatment of epilepsy within 30 days of enrollment

The above is a clinical trial exclusion criterion. Annotated with entity spans:
Subjects who have received [Drug: valproic acid] for [Procedure: treatment] of [Condition: epilepsy] [Temporal: within 30 days of enrollment]